Clinical trial inclusion criterion:
Person was never fitted with microprocessor controlled prosthetic knee joint.

Annotated entities:
- Negation: "never"
- Device: "prosthetic knee joint"
- Qualifier: "microprocessor controlled"